Clinical trial inclusion criterion:
Be willing to comply with study procedures

Annotated entities:
- Informed_consent: "Be willing to comply with study procedures"